Present to ED primary for management of LBP, defined as pain originating between the lower border of the scapulae and the upper gluteal folds. Flank pain, that is pain originating from tissues lateral to the paraspinal muscles, will not be included.

The above is a clinical trial inclusion criterion. Annotated with entity spans:
[Observation: Present] to [Visit: ED] primary for management of [Condition: LBP], defined as [Condition: pain] originating [Qualifier: between the lower border of the scapulae and the upper gluteal folds]. [Condition: Flank pain], that is [Condition: pain] originating from [Qualifier: tissues lateral to the paraspinal muscles], will [Negation: not] be included.